關於集尿管（collecting duct）對於水分再吸收的描述，下列何者錯誤？
A. 剛進入集尿管的腎小管內液屬低張溶液（hypotonic solution）
B. 集尿管受到抗利尿激素（antidiuretic hormone）作用而改變其對於水分的通透性與再吸收
C. 集尿管主要利用第一型水通道（aquaporin-1）增加水分再吸收
D. 在極需水分的狀況下，高達99.7%的水分可被再吸收回到體循環

正確答案：C. 集尿管主要利用第一型水通道（aquaporin-1）增加水分再吸收